Clinical trial exclusion criterion:
presence of a homogeneously echogenic effusion on pleural US27 -

Annotated entities:
- Condition: "homogeneously echogenic effusion"
- Procedure: "pleural US"